Clinical trial exclusion criterion:
Evidence of hepatocellular carcinoma at the time of enrollment

Annotated entities:
- Condition: "hepatocellular carcinoma"